Participation in another study with investigational drug within the 30 days preceding and during the present study

The above is a clinical trial exclusion criterion. Annotated with entity spans:
[Non-query-able: Participation in another study with investigational drug within the 30 days preceding and during the present study]